Clinical trial inclusion criterion:
Not having taken the direct oral anticoagulant on the day of the extraction

Entity relations:
- Has_index("on the day of the extraction", "extraction")
- Has_qualifier("anticoagulant", "oral")
- Has_negation("anticoagulant", "Not")
- Has_temporal("anticoagulant", "on the day of the extraction")